Acute Deep Vein Thrombosis

The above is a clinical trial exclusion criterion. Annotated with entity spans:
[Condition: Acute Deep Vein Thrombosis]